Clinical trial exclusion criterion:
Patients under the age of 18 (Subjects under the age of 18 will not be included in this study due to the continued growth and development of their joints and unstudied effects on children.)

Entity relations:
- Has_value("age", "18 under")